Clinical trial inclusion criterion:
Intraoperative use of vasopressin and uterine tourniquet is permissible

Annotated entities:
- Non-representable: "Intraoperative use of vasopressin and uterine tourniquet is permissible"